Clinical trial exclusion criterion:
Foreshortened life-expectancy or severe comorbidities precluding study follow-up period

Entity relations:
- Has_value("life-expectancy", "Foreshortened")
- OR("life-expectancy", "severe comorbidities")